Clinical trial exclusion criterion:
Receiving drugs acting primarily on the central nervous system, which lower the seizure threshold (see appendix 2)

Entity relations:
- Has_qualifier("drugs acting primarily on the central nervous system", "lower the seizure threshold")